Clinical trial exclusion criterion:
Anteriorly located tumor

Entity relations:
- Has_qualifier("tumor", "Anteriorly located")